Subject has any untreated or uncontrolled hyperthyroidism or hypothyroidism.

The above is a clinical trial exclusion criterion. Annotated with entity spans:
Subject has any [Qualifier: untreated] or [Qualifier: uncontrolled] [Condition: hyperthyroidism] or [Condition: hypothyroidism].